What is the mode of action of dexamethasone?

yes, dexamethasone is used to treat acute graft-versus-host disease (agvhd) due to its immunosuppressive activity.